Clinical trial inclusion criteria:
Signed informed consent form (ICF)
Age 18 to 55 years old (inclusive) as of the date the ICF is signed
Diagnosis of MS according to the McDonald criteria 2010 and cranial MRI scan demonstrating white matter lesions attributable to MS within 10 years before Screening
Onset of MS symptoms (as determined by a neurologist, either at present or retrospectively) within 10 years of the date the ICF is signed
EDSS score 0.0 to 5.0 (inclusive) at Screening
Patients with (highly) active RRMS disease course indicated to receive alemtuzumab according to the following conditions (at least 1 out of 3 conditions has to be fulfilled): 1. =2 MS relapses within 24 months, 2. clinical (=1 relapse) or MRI (new gadolinium enhancing lesions) disease activity under therapy with other diseasemodifying therapies, 3. severe relapse with high disease activity (=9 T2 hyperintense Lesions and =1 gadolinium enhancing lesion) on MRI.
Completion of all vaccinations required by the applicable immunization guidelines published by "ständige Impfkommission" (STIKO)
History of chickenpox or positive test for antibodies against varicella zoster virus (VZV)

Annotated entities:
- Informed_consent: "Signed informed consent form (ICF)"
- Person: "Age"
- Value: "18 to 55 years old ("
- Condition: "MS"
- Measurement: "McDonald criteria 2010"
- Procedure: "cranial MRI scan"
- Temporal: "within 10 years before Screening"
- Condition: "MS symptoms"
- Temporal: "within 10 years"
- Measurement: "EDSS score"
- Value: "0.0 to 5.0"
- Condition: "RRMS"
- Qualifier: "active"
- Drug: "alemtuzumab"
- Condition: "MS relapses"
- Multiplier: "=2"
- Temporal: "within 24 months,"
- Condition: "relapse"
- Multiplier: "=1"
- Procedure: "MRI"
- Condition: "relapse"
- Qualifier: "severe"
- Condition: "Lesions"
- Qualifier: "T2 hyperintense"
- Multiplier: "=9"
- Condition: "lesion"
- Qualifier: "gadolinium enhancing"
- Multiplier: "=1"
- Procedure: "MRI"
- Condition: "lesions"
- Qualifier: "gadolinium enhancing"
- Qualifier: "new"
- Non-query-able: "Completion of all vaccinations required by the applicable immunization guidelines published by "ständige Impfkommission" (STIKO)"
- Condition: "chickenpox"
- Measurement: "test for antibodies"
- Value: "positive"
- Qualifier: "varicella zoster virus"
- Qualifier: "VZV"